Clinical trial exclusion criterion:
Patients with history of bleeding disorders or on anticoagulant therapy.

Annotated entities:
- Condition: "bleeding disorders"
- Procedure: "anticoagulant therapy"
- Temporal: "history"